definite unilateral vestibulopathy

The above is a clinical trial inclusion criterion. Annotated with entity spans:
definite [Qualifier: unilateral] [Condition: vestibulopathy]